在流行性感冒病毒（influenza virus）感染時，下列何種抗原所誘發的抗體較具保護性：
A. M protein
B. non-structural protein
C. haemagglutinin
D. nucleocapsid

正確答案：C. haemagglutinin